History of drug/alcohol abuse.

The above is a clinical trial exclusion criterion. Annotated with entity spans:
[Temporal: History] of [Condition: drug/alcohol abuse].